Untreated coeliac disease or other concomitant condition likely to affect BG control

The above is a clinical trial exclusion criterion. Annotated with entity spans:
[Qualifier: Untreated] [Condition: coeliac disease] or other concomitant condition likely to affect BG control